Clinical trial exclusion criterion:
History of viscosupplementation or platelet-rich plasma to affected shoulder within the last 6 months

Annotated entities:
- Procedure: "viscosupplementation"
- Drug: "platelet-rich plasma"
- Qualifier: "shoulder"
- Temporal: "last 6 months"
- Temporal: "History of"